Hair-Acanthosis Nigricans 症候群不包括：
A. 雄性素過高症（Hyperandrogenism）
B. 性腺激素過高
C. 胰島素抗阻性（Insulin resistance）
D. Acanthosis nigricans

正確答案：B. 性腺激素過高